Clinical trial inclusion criteria:
Aged at least 18 years with an ability and willingness to give written informed consent.
Body mass index 25-35 kg/m2
Users of at least 2 cups of caffeinated coffee per day who are willing to be randomized to any of the interventions.
Non-smoking

Annotated entities:
- Person: "Aged"
- Value: "at least 18 years"
- Observation: "ability to give written informed consent"
- Observation: "willingness to give written informed consent"
- Measurement: "Body mass index"
- Value: "25-35 kg/m2"
- Multiplier: "at least 2 cups per day"
- Drug: "caffeinated coffee"
- Observation: "willing to be randomized"
- Condition: "Non-smoking"